臨床上引起 Hypoxic hypoxia 最常見的為何？
A. Ventilation-perfusion imbalance
B. Venous-arterial shunt
C. Central hypoventilation
D. Breathing less than 21% oxygen

正確答案：A. Ventilation-perfusion imbalance